Clinical trial exclusion criterion:
Previous randomization in this study

Annotated entities:
- Non-query-able: "Previous randomization in this study"